Clinical trial exclusion criterion:
Sensitization (i.e. PRA >20%)

Entity relations:
- Has_value("PRA", ">20%")
- Subsumes("Sensitization", "PRA")